Clinical trial exclusion criterion:
Fetal weight estimation > 4500 g (clinical or ultrasonic)

Annotated entities:
- Measurement: "Fetal weight estimation"
- Value: "> 4500 g"
- Qualifier: "clinical"
- Procedure: "ultrasonic"